Age ≥18 years

The above is a clinical trial inclusion criterion. Annotated with entity spans:
[Person: Age] [Value: ≥18 years]